Clinical trial exclusion criterion:
Individuals who have performed other restorations in the last 12 months;

Entity relations:
- Has_temporal("other restorations", "in the last 12 months")